Allergy or hypersensitivity to target medication or any of its components

The above is a clinical trial exclusion criterion. Annotated with entity spans:
[Condition: Allergy] or [Condition: hypersensitivity] to [Drug: target medication] or any of its components